Clinical trial exclusion criterion:
Untreated pituitary insufficiency.

Annotated entities:
- Condition: "pituitary insufficiency"
- Qualifier: "Untreated"